Haemochromatosis

The above is a clinical trial exclusion criterion. Annotated with entity spans:
[Condition: Haemochromatosis]